Clinical trial inclusion criterion:
6. If a woman of childbearing potential, have a negative urine pregnancy test at Visit 1 and be using an adequate method of birth control throughout the study period.

Annotated entities:
- Parsing_Error: "6."
- Person: "woman"
- Condition: "childbearing potential"
- Measurement: "urine pregnancy test"
- Value: "negative"
- Temporal: "at Visit 1"
- Reference_point: "Visit 1"
- Device: "method of birth control"
- Qualifier: "adequate"
- Subjective_judgement: "adequate"
- Temporal: "throughout the study period"
- Reference_point: "study period"